Clinical trial exclusion criterion:
Female sterilization (have had surgical bilateral oophorectomy with or without hysterectomy) or tubal ligation at least six weeks before taking study treatment. In case of oophorectomy alone, only when the reproductive status of the woman has been confirmed by follow up hormone level assessment

Entity relations:
- Has_index("at least six weeks before taking study treatment", "taking study treatment")
- Subsumes("Female sterilization", "bilateral oophorectomy")
- Subsumes("Female sterilization", "hysterectomy")
- Subsumes("Female sterilization", "at least six weeks before taking study treatment")
- OR("Female sterilization", "tubal ligation")